Clinical trial inclusion criterion:
Neutrophils > 1.5 109/l, Platelets > 100 109/l, Hemoglobin > 9g/dl, Total bilirubin < 1.5 UNL, AST (SGOT) and ALT (SGPT) < 2.5 UNL, Alkaline phosphatases < 5 UNL, Creatinine < 1 UNL

Entity relations:
- Has_value("ALT (SGPT)", "< 2.5 UNL")
- Has_value("AST (SGOT)", "< 2.5 UNL")
- Has_value("Creatinine", "< 1 UNL")
- Has_value("Alkaline phosphatases", "< 5 UNL")
- Has_value("Total bilirubin", "< 1.5 UNL")
- Has_value("Hemoglobin", "> 9g/dl")
- Has_value("Platelets", "> 100 109/l")
- Has_value("Neutrophils", "> 1.5 109/l")